Clinical trial inclusion criteria:
Healthy patients (ASA I)
Bilateral symmetrically impacted lower third molars according to Pel-Gregory's and Winter's classification

Annotated entities:
- Condition: "Healthy patients"
- Measurement: "ASA"
- Value: "I"
- Measurement: "Pel-Gregory's and Winter's classification"
- Value: "Bilateral symmetrically impacted lower third molars"